Premenopausal women who are nursing or pregnant

The above is a clinical trial exclusion criterion. Annotated with entity spans:
[Condition: Premenopausal] [Person: women] who are [Condition: nursing] or [Condition: pregnant]